Clinical trial inclusion criterion:
MMSE (Mini Mental State Examination)score > or = 15

Entity relations:
- Has_value("MMSE (Mini Mental State Examination)", "score > or = 15")